有位 50 歲民眾接受健檢時，body mass index = 33 kg/m2，上消化道內視鏡檢查發現有糜爛性食道炎（erosive esophagitis），屬LA classification grade A。經仔細詢問，他並無明顯心窩灼熱感（heartburn），也沒有胃酸逆流的感覺，食物吞嚥也正常。下列各項敘述，何者最正確？
A. 應立即給予服用proton pump inhibitor（PPI）至少4個月
B. 未來應每年檢查上消化道內視鏡一次
C. 應進一步檢查食道內之pH值
D. 應建議他減重，並少喝酒、咖啡及茶，少吃油脂類及酸性食物

正確答案：D. 應建議他減重，並少喝酒、咖啡及茶，少吃油脂類及酸性食物